Potential contraindications to regadenoson use due to:

The above is a clinical trial exclusion criterion. Annotated with entity spans:
[Non-representable: Potential contraindications to regadenoson use due to:]